Clinical trial exclusion criterion:
Extraliver metastases

Entity relations:
- Has_qualifier("metastases", "Extraliver")
- multi("Extraliver metastases", "metastases")